Clinical trial inclusion criterion:
Caucasian patients affected by uncomplicated, essential hypertension, not well controlled by concomitant administration of ACE-I or ARBs and diuretics at the maximum dosage.

Annotated entities:
- Person: "Caucasian"
- Condition: "essential hypertension"
- Qualifier: "uncomplicated"
- Drug: "ACE-I"
- Drug: "ARBs"
- Drug: "diuretics"
- Multiplier: "maximum dosage"
- Qualifier: "not well controlled"